Consecutive fibrinolytic states to coagulopathy

The above is a clinical trial exclusion criterion. Annotated with entity spans:
Consecutive [Condition: fibrinolytic states] to [Condition: coagulopathy]